Clinical trial exclusion criterion:
Significant heart disease (chronic congestive heart failure, symptomatic coronary disease) or myocardial infarction in the previous 6 months

Entity relations:
- Has_qualifier("heart disease", "Significant")
- Subsumes("heart disease", "chronic congestive heart failure")
- Has_temporal("myocardial infarction", "in the previous 6 months")
- OR("chronic congestive heart failure", "symptomatic coronary disease")
- OR("heart disease", "myocardial infarction")